Subject has used non-steroidal anti-inflammatory drugs including aspirin, two times per week, during the 4 weeks preceding enrollment. Low dose aspirin regimens (< 100 mg daily) are acceptable and not exclusionary.

The above is a clinical trial exclusion criterion. Annotated with entity spans:
Subject has used [Drug: non-steroidal anti-inflammatory drugs] including [Drug: aspirin], [Multiplier: two times per week], [Temporal: during the 4 weeks preceding] [Reference_point: enrollment]. [Qualifier: Low dose] [Drug: aspirin] regimens ([Multiplier: < 100 mg daily]) are acceptable and [Grammar_Error: not exclusionary].